What is the function of the ISW1 and CHD1 remodellers in yeast chromatin?

We propose that CHD1 directs short spacing, resulting in eviction of H1 and chromatin unfolding, whereas ISW1 directs longer spacing, allowing H1 to bind and condense the chromatin